Clinical trial inclusion criterion:
In self-reported menopause, defined as the permanent cessation of ovulation, for at least one year (Soules et al., 2001).

Annotated entities:
- Condition: "menopause"
- Condition: "cessation of ovulation"
- Qualifier: "permanent"
- Temporal: "at least one year"